Clinical trial inclusion criterion:
Presence of at least 2 cryopreserved good quality cleavage-stage embryo (good quality cleavage-stage embryos display stage-specific cell division, have blastomeres of fairly equal size with few to no cytoplasmic fragments).

Entity relations:
- Has_qualifier("cleavage-stage embryo", "good")
- Has_qualifier("cleavage-stage embryo", "cryopreserved")
- Has_multiplier("cleavage-stage embryo", "at least 2")